Clinical trial exclusion criterion:
Chronic use of opioid

Entity relations:
- Has_multiplier("opioi", "Chronic use")